Clinical trial inclusion criterion:
Men must be completely contraception and prohibited donation and sperm donation during the treatment process and in 28 days after treatment;

Annotated entities:
- Person: "Men"
- Procedure: "contraception"
- Negation: "prohibited"
- Procedure: "sperm donation"
- Temporal: "during the treatment process"
- Temporal: "in 28 days after treatment"
- Reference_point: "treatment"
- Reference_point: "treatment"
- Procedure: "donation"